Clinical trial exclusion criterion:
Intake of medicines listed in the section 'Prohibited concomitant treatment' for 1 month prior to the enrollment in the trial.

Annotated entities:
- Drug: "medicines"
- Qualifier: "listed in the section 'Prohibited concomitant treatment'"
- Temporal: "1 month prior to the enrollment in the trial"
- Reference_point: "the enrollment in the trial"